Clinical trial inclusion criterion:
age =18 at screening

Entity relations:
- Has_value("age", "=18")